關於異位性皮膚炎（atopic dermatitis）致病機轉的敘述，下列何者錯誤？
A. FLG基因突變使filaggrin的製造減少
B. 可觀察到皮膚生理功能（包括經皮水分散失及含水量）異常
C. 病人的皮膚免疫系統缺陷，因此易合併細菌感染
D. 慢性期的病理機轉主要以 Th2細胞的活化為主要之角色，Th1細胞角色較少

正確答案：D. 慢性期的病理機轉主要以 Th2細胞的活化為主要之角色，Th1細胞角色較少